知情同意（informed consent）的實踐，是在落實那一項醫學倫理原則？
A. 行善原則（beneficence）
B. 不傷害原則（non-maleficence）
C. 正義原則（justice）
D. 尊重自主原則（respect for autonomy）

正確答案：D. 尊重自主原則（respect for autonomy）